Diabetes

The above is a clinical trial exclusion criterion. Annotated with entity spans:
[Condition: Diabetes]